Clinical trial exclusion criterion:
Non-reassuring fetal assessment at the time of recruitment

Annotated entities:
- Value: "Non-reassuring"
- Measurement: "fetal assessment"
- Temporal: "at the time of recruitment"